Clinical trial inclusion criterion:
Routine bloods including U&E, FBC, LFTs, inflammatory markers (CRP) and albumin will be measured.

Entity relations:
- Subsumes("Routine bloods", "U&E")
- OR("U&E", "inflammatory markers (CRP)", "LFTs", "FBC", "albumin")